Substantial suicidality in a patient requiring admission but refuses to do so, and signs an "against medical advice" release form as part of clinical evaluation, and does not answer the terms for involuntary admission.

The above is a clinical trial exclusion criterion. Annotated with entity spans:
[Qualifier: Substantial] [Condition: suicidality] in a patient requiring [Procedure: admission] but refuses to do so, and [Non-representable: signs an "against medical advice" release form as part of clinical evaluation, and does not answer the terms for involuntary admission].